Global Initiative for Chronic Obstructive Lung Disease (GOLD) 0: FEV1=0.80 and FEV1/FVC>0.70 Forced Expiratory Volume in 1 second (FEV1), Forced Vital Capacity (FVC)

The above is a clinical trial inclusion criterion. Annotated with entity spans:
[Measurement: Global Initiative for Chronic Obstructive Lung Disease (GOLD)] [Value: 0]: [Measurement: FEV1][Value: =0.80] and [Measurement: FEV1/FVC][Value: >0.70] [Non-representable: Forced Expiratory Volume in 1 second (FEV1), Forced Vital Capacity (FVC)]